下列何種腦腫瘤使用皮質類固醇（corticosteroid）治療後，雖然會減輕腦水腫（brain edema），但也會使腦腫瘤消退（tumor regression）而影響正確的組織細胞學的診斷 （histological diagnosis）？
A. 多形性膠質母細胞瘤（glioblastoma multiforme）
B. 室管膜瘤（ependymoma）
C. 顱咽管瘤（craniopharyngioma）
D. 原發性中樞神經淋巴瘤（primary CNS lymphoma）

正確答案：D. 原發性中樞神經淋巴瘤（primary CNS lymphoma）